La tinción de ácido-alcohol resistentes es positiva en bacterias del género:
1. Mycoplasma.
2. Helicobacter.
3. Borrelia.
4. Mycobacterium.
5. Clostridum.

Respuesta correcta: 4. Mycobacterium.